Clinical trial inclusion criterion:
Panel Reactive Antibody (PRA) < 30%.

Entity relations:
- Has_value("Panel Reactive Antibody (PRA)", "< 30%")